Clinical trial inclusion criterion:
A signed and dated written informed consent is obtained prior to participation.

Annotated entities:
- Observation: "written informed consent"
- Temporal: "prior to participation"